Las descalificaciones e insultos verbales pueden ser un ejemplo de:
1. Estímulos primarios.
2. Estímulos disuasorios.
3. Estímulos aversivos incondicionados.
4. Estímulos aversivos condicionados.

Respuesta correcta: 4. Estímulos aversivos condicionados.